En relación a los problemas clínicos que con mayor prevalencia pueden presentar los recién nacidos prematuros de muy bajo peso al nacer en los primeros días de vida. ¿Cuál de las siguientes afirmaciones es correcta?:
1. La causa principal de las alteraciones que se presentan en la función respiratoria del recién nacido prematuro (enfermedad de la membrana hialina) es la administración prenatal tardía de corticoides.
2. La depleción de volumen intravascular es la causa más frecuente de hipotensión en prematuros de muy bajo peso, siendo la expansión con coloides (albumina al 5% diluida al medio) la terapia de elección.
3. La persistencia del conducto arterioso (ductus) produce las manifestaciones clínicas típicas de cortocircuito derecha-izquierda.
4. La vulnerabilidad del neonato prematuro a la hipoxia e hipertensión arterial se asocian a un mayor riesgo de presentación de hemorragia intraventricular.

Respuesta correcta: 4. La vulnerabilidad del neonato prematuro a la hipoxia e hipertensión arterial se asocian a un mayor riesgo de presentación de hemorragia intraventricular.